Clinical trial inclusion criteria:
Lobectomy or pneumonectomy
Esophagectomy
Radical (total) cystectomy
Pancreatectomy
Partial hepatectomy
Hyperthermic intraperitoneal chemotherapy (HIPEC)
Gastrectomy (subtotal or total)
Cholecystectomy or bile duct resection

Annotated entities:
- Procedure: "Lobectomy"
- Procedure: "pneumonectomy"
- Procedure: "Esophagectomy"
- Procedure: "Radical cystectomy"
- Procedure: "total cystectomy"
- Procedure: "Pancreatectomy"
- Procedure: "Partial hepatectomy"
- Procedure: "Hyperthermic intraperitoneal chemotherapy"
- Procedure: "HIPEC"
- Procedure: "Gastrectomy"
- Qualifier: "subtotal"
- Qualifier: "total"
- Procedure: "Cholecystectomy"
- Procedure: "bile duct resection"